Liberan noradrenalina las:
1. Fibras preganglionares simpáticas.
2. Fibras postganglionares simpáticas
3. Fibras preganglionares parasimpáticas
4. Fibras postganglionares parasimpáticas
5. Únicamente las células cromafines.

Respuesta correcta: 2. Fibras postganglionares simpáticas